Conditions that may affect the compliance to the study.

The above is a clinical trial exclusion criterion. Annotated with entity spans:
[Post-eligibility: Conditions that may affect the compliance to the study.]